脊椎動物中，由下列那種酵素合成5S rRNA與tRNA？
A. RNA polymerase I
B. RNA polymerase II
C. RNA polymerase III
D. ribosomal RNase

正確答案：C. RNA polymerase III